關於細胞膜上的膽固醇（cholesterol）其結構及功能的敘述，下列何者正確？
A. 與細胞膜相較，胞器膜（membrane of the organelle）上的膽固醇含量較多
B. 膽固醇帶極性的羥基（polar hydroxyl group）鑲嵌於細胞膜的雙脂層（lipid bilayers）夾層內部（interior）
C. 膽固醇可幫助調節細胞膜的膜流動性（membrane fluidity）
D. 膽固醇在細胞膜內外側的分布是對稱的（symmetric）

正確答案：C. 膽固醇可幫助調節細胞膜的膜流動性（membrane fluidity）